經過多年的研究，終於發現藥物X可以促進轉錄因子FoxP3的表現，而轉錄因子FoxP3主要表現在CD4+ T細胞上，且這些T細胞會分泌IL-10及TGF-β，並且表現CTLA-4分子。藥物X最不可能用來控制那種疾病？
A. 移植排斥
B. 紅斑性狼瘡
C. 氣喘
D. 腫瘤

正確答案：D. 腫瘤